Clinical trial exclusion criterion:
Patients with other factors causing liver diseases.

Annotated entities:
- Condition: "liver diseases"
- Non-query-able: "Patients with other factors causing liver diseases"